下列何細胞具有胞內小管（intracellular canaliculi）？
A. 腸內分泌細胞（enteroendocrine cell）
B. 頸黏液細胞（mucous neck cell）
C. 壁細胞（parietal cell）
D. 主細胞（chief cell）

正確答案：C. 壁細胞（parietal cell）